Age less than 18 yrs

The above is a clinical trial exclusion criterion. Annotated with entity spans:
[Person: Age] [Value: less than 18 yrs]